Able to give fully informed consent in writing

The above is a clinical trial inclusion criterion. Annotated with entity spans:
[Post-eligibility: Able to give fully informed consent in writing]